Clinical trial inclusion criterion:
Be 19 years of age or older

Annotated entities:
- Value: "19 years of age or older"
- Person: "age"